下列何種疾病與感染或異常免疫反應無關？
A. 多發性硬化症（multiple sclerosis）
B. 急性散播性腦脊髓炎（acute disseminated encephalomyelitis）
C. 腎上腺腦白質病（adrenoleukodystrophy）
D. 急性神經根炎（Guillain-Barré syndrome）

正確答案：C. 腎上腺腦白質病（adrenoleukodystrophy）